Clinical trial inclusion criterion:
PLT = 80 × 109 / L

Annotated entities:
- Measurement: "PLT"
- Value: "= 80 × 109 / L"